下列關於紅血球醣代謝之敘述，何者正確？
A. 由糖解作用（glycolysis）產生的ATP是紅血球主要的能量來源
B. 紅血球中糖解作用（glycolysis）除用於產生能量外並無其他功能
C. 克氏循環（TCA cycle）會消耗少部分紅血球所攜帶的氧氣
D. 紅血球中五碳糖磷酸途徑（pentose phosphate pathway）係在粒線體中進行

正確答案：A. 由糖解作用（glycolysis）產生的ATP是紅血球主要的能量來源